14. Insulin-dependent diabetes mellitus.

The above is a clinical trial exclusion criterion. Annotated with entity spans:
[Parsing_Error: 14.] [Condition: Insulin-dependent diabetes mellitus].